Eastern Cooperative Oncology Group (ECOG) Performance status ≤ 2

The above is a clinical trial inclusion criterion. Annotated with entity spans:
[Measurement: Eastern Cooperative Oncology Group (ECOG) Performance status] [Value: ≤ 2]